Clinical trial exclusion criterion:
Clinically significant laboratory abnormalities.

Annotated entities:
- Condition: "laboratory abnormalities"
- Procedure: "laboratory"
- Qualifier: "Clinically significant"
- Subjective_judgement: "Clinically significant"